Clinical trial exclusion criterion:
Previous surgical or catheter ablation for atrial fibrillation

Entity relations:
- AND("catheter ablation", "atrial fibrillation")
- Has_temporal("catheter ablation", "Previous")
- OR("catheter ablation", "ablation surgical")